Clinical trial inclusion criteria:
Male or female term baby with gestational >37 weeks and postnatal age < or= 28 days
Birthweight >2500g
Written informed consent of parent or guardian

Annotated entities:
- Person: "Male"
- Person: "female"
- Condition: "term"
- Person: "baby"
- Measurement: "gestational"
- Value: ">37 weeks"
- Measurement: "postnatal age"
- Value: "< or= 28 days"
- Measurement: "Birthweight"
- Value: ">2500g"
- Informed_consent: "Written informed consent of parent or guardian"